Clinical trial exclusion criterion:
left atrial thrombus on transesophageal echocardiography study performed after successful left atrial appendage closure but before enrollment

Entity relations:
- Has_qualifier("left atrial appendage closure", "successful")
- multi("after successful left atrial appendage closure", "left atrial appendage closure")
- Has_index("after successful left atrial appendage closure", "successful left atrial appendage closure")
- AND("transesophageal echocardiography", "left atrial thrombus")
- Has_temporal("transesophageal echocardiography", "after successful left atrial appendage closure")
- Has_index("before enrollment", "enrollment")
- Has_temporal("transesophageal echocardiography", "before enrollment")